Which protein is regulated by Tudor interacting repair regulator (TIRR)?

Tudor interacting repair regulator (TIRR) regulates P53-binding protein 1 (53BP1) by masking its histone methyl-lysine binding function.